lactating, pregnant or planning pregnancy

The above is a clinical trial exclusion criterion. Annotated with entity spans:
l[Pregnancy_considerations: actating, pregnant or planning pregnancy]